Clinical trial exclusion criterion:
Subjects were not to have had an abnormal diet or substantial changes in eating habits within 30 days prior to study initiation.

Annotated entities:
- Observation: "abnormal diet"
- Observation: "changes in eating habits"
- Qualifier: "substantial"
- Temporal: "within 30 days prior to study initiation"
- Reference_point: "study initiation"
- Negation: "not"